Single unit implant rehabilitation

The above is a clinical trial inclusion criterion. Annotated with entity spans:
[Procedure: Single unit implant rehabilitation]